Patients = 18 years of age

The above is a clinical trial inclusion criterion. Annotated with entity spans:
Patients [Value: = 18 years] of [Person: age]